Clinical trial exclusion criterion:
19. Use of a platelet-derived growth factor within 28 days before screening

Annotated entities:
- Parsing_Error: "19."
- Drug: "platelet-derived growth factor"
- Temporal: "within 28 days before screening"
- Reference_point: "screening"